Clinical trial exclusion criterion:
Renal failure (Cl Cr < 60 mL /min /1,73m),

Annotated entities:
- Condition: "Renal failure"
- Measurement: "Cl Cr"
- Value: "< 60 mL /min /1,73m"